COPD

The above is a clinical trial exclusion criterion. Annotated with entity spans:
[Condition: COPD]